下列那些腦膜炎，如果沒有及早治療，容易發生顱底腦膜嚴重滲出性發炎變化（basilar meningeal exduate），導致次發性腦血管梗塞（cerebral infarction）？①腮腺炎病毒腦膜炎（mumps） ②巨細胞病毒性腦膜炎（CMV） ③結核菌腦膜炎 ④ 隱球菌腦膜炎
A. ①②
B. ②③
C. ①④
D. ③④

正確答案：D. ③④